Clinical trial inclusion criterion:
Written informed consent obtained

Annotated entities:
- Informed_consent: "Written informed consent obtained"